本雅病毒（Bunyaviruses）大多藉由節肢動物傳播，然而下列何者例外？
A. 漢坦病毒（Hantaan virus）
B. 裂谷熱病毒（Rift valley fever virus）
C. 加利福尼亞腦炎病毒（California encephalitis virus）
D. 克里米亞-剛果出血熱病毒（Crimean-Congo hemorrhagic fever virus）

正確答案：A. 漢坦病毒（Hantaan virus）